Clinical trial exclusion criterion:
Prior history of hypersensitivity to sildenafil

Entity relations:
- AND("hypersensitivity", "sildenafil")
- Has_temporal("hypersensitivity", "Prior history")